Clinical trial exclusion criteria:
Obstructed outlet syndrome (objectified by defeacography)
Irritable bowel syndrome (Rome-IV criteria for irritable bowel syndrome)
Congenital or organic bowel pathology
Rectal prolapse
Anatomical limitations preventing placement of an electrode
Skin and perineal disease with risk of infection
Previous large bowel/rectal surgery
Stoma
Coexisting neurological disease
Significant psychological co-morbidity as assessed subjectively by the investigator
Being or attempting to become pregnant during study follow-up

Annotated entities:
- Condition: "Obstructed outlet syndrome"
- Procedure: "defeacography"
- Condition: "Irritable bowel syndrome"
- Measurement: "Rome-IV criteria"
- Condition: "irritable bowel syndrome"
- Condition: "organic bowel pathology"
- Condition: "Congenital bowel pathology"
- Condition: "Rectal prolapse"
- Observation: "Anatomical limitations"
- Procedure: "placement of an electrode"
- Negation: "preventing"
- Non-query-able: "Anatomical limitations preventing placement of an electrode"
- Condition: "perineal disease"
- Condition: "Skin disease"
- Observation: "risk of infection"
- Parsing_Error: "and"
- Procedure: "rectal surgery"
- Procedure: "large bowel surgery"
- Parsing_Error: "/"
- Condition: "Stoma"
- Condition: "neurological disease"
- Condition: "psychological co-morbidity"
- Qualifier: "Significant"
- Subjective_judgement: "as assessed subjectively by the investigator"
- Pregnancy_considerations: "Being or attempting to become pregnant during study follow-up"